Clinical trial exclusion criteria:
American Association of Anesthesiology class 1-3
American Heart Association class >3
BMI >37
Insulin treated diabetes
Pregnancy or breast feeding
Sensistivity/allergy against anesthetic agents
Inadequate understanding about the study
Depressed kidney function and/or AKI
Depressed liver function
Genetic malignant hyperthermia

Annotated entities:
- Measurement: "American Association of Anesthesiology class"
- Value: "1-3"
- Measurement: "American Heart Association class"
- Value: ">3"
- Measurement: "BMI"
- Value: ">37"
- Qualifier: "Insulin treated"
- Condition: "diabetes"
- Drug: "Insulin"
- Condition: "Pregnancy"
- Observation: "breast feeding"
- Condition: "Sensistivity"
- Condition: "allergy"
- Drug: "anesthetic agents"
- Observation: "Inadequate understanding about the study"
- Value: "Depressed"
- Measurement: "kidney function"
- Condition: "AKI"
- Condition: "Depressed kidney function"
- Value: "Depressed"
- Measurement: "liver function"
- Condition: "Depressed liver function"
- Qualifier: "Genetic"
- Condition: "malignant hyperthermia"